Toll-like receptors（TLRs）執行訊息傳遞，下列那一種可存在於內胞體（endosome）中，能辨識病毒之雙股 RNA（dsRNA）？
A. TLR-3
B. TLR-4
C. TLR-5
D. TLR-7

正確答案：A. TLR-3